Clinical trial inclusion criterion:
Oswestry Questionnaire score of at least 40/100 at baseline.

Annotated entities:
- Measurement: "Oswestry Questionnaire score"
- Value: "at least 40/100"
- Temporal: "at baseline"